1. Presence of bacteremia due solely to:

The above is a clinical trial inclusion criterion. Annotated with entity spans:
1. Presence of [Condition: bacteremia] [Parsing_Error: due solely to:]